剝離性骨軟骨炎（osteochondritis dissecans）可在許多關節部位發生，下列何處最少發生此症？
A. 肘關節
B. 肩關節
C. 膝關節
D. 踝關節

正確答案：B. 肩關節